三發性副甲狀腺機能亢進（tertiary hyperparathyroidism），何者正確？
A. 為腎移植後一年，鈣、副甲狀腺素持續升高，應手術治療
B. 骨疼痛、皮膚癢不嚴重，應手術治療
C. 骨密度未下降（T>-2.5），應手術治療
D. 不作全切除也不易再發

正確答案：A. 為腎移植後一年，鈣、副甲狀腺素持續升高，應手術治療